Clinical trial inclusion criterion:
Patient signing the consent form for at least the blood sample

Annotated entities:
- Post-eligibility: "Patient signing the consent form for at least the blood sample"